Clinical trial exclusion criterion:
Human immunodeficiency virus-positive status

Annotated entities:
- Measurement: "Human immunodeficiency virus"
- Value: "positive"